What is the genus for the common European honey bee?

The genus and species of the European honey bee is Apis mellifera.